¿Cuál sería el coeficiente de extracción hepática de un fármaco y su aclaramiento hepático si se conoce que en situación de equilibrio la concentración en sangre arterial, de entrada al hígado es de 8 g/mL y la de sangre venosa, de salida al mismo órgano, es de 4 g/mL? Considerar un flujo hepático de 90 L/h:
1. 4,0 y 360 L/h.
2. 0,5 y 45 L/h.
3. 1,0 y 90 L/h.
4. 0,25 y 20 L/h.
5. 2,0 y 180 L/h.

Respuesta correcta: 2. 0,5 y 45 L/h.